下列何者沒有足底彎曲（plantar flexion）的作用？
A. 腓腸肌（gastrocnemius）
B. 第三腓骨肌（peroneus tertius）
C. 腓長肌（peroneus longus）
D. 脛後肌（tibialis posterior）

正確答案：B. 第三腓骨肌（peroneus tertius）